Señale la respuesta FALSA de entre las siguientes en relación con el concepto de gastritis:
1. Es un término que debe reservarse para la definir la existencia de inflamación histológica en la mucosa gástrica.
2. Existe un espectro de manifestaciones clínicas claramente definidas en relación con la existencia de gastritis.
3. El Helicobacter pylori es una causa frecuente de gastritis.
4. Existe una escasa correlación entre los datos histológicos, los síntomas del paciente y los datos endoscópicos.

Respuesta correcta: 2. Existe un espectro de manifestaciones clínicas claramente definidas en relación con la existencia de gastritis.